B. Non-castrate metastatic: Patients must present with radiographic evidence of metastatic disease at the time of diagnosis or after treatment for localized disease. These patients must show newly detected disease or progressing disease in bone or in soft tissue. Biochemical progression is defined as: minimum no. of determinations: 3 Interval: >2 weeks Minimal Baseline PSA value (ng/ml): 2 Minimal % increase in range of values: 50%

The above is a clinical trial inclusion criterion. Annotated with entity spans:
B. [Qualifier: Non-castrate] [Qualifier: metastatic]: Patients must present with [Observation: radiographic evidence] of [Condition: metastatic disease] [Temporal: at the time of diagnosis] or [Temporal: after treatment for localized disease]. These patients must show [Temporal: newly detected] [Condition: disease] or [Condition: progressing disease in bone] or in soft tissue. [Observation: Biochemical progression] is defined as: [Measurement: minimum no. of determinations]: [Value: 3] [Measurement: Interval]: [Value: >2 weeks] [Measurement: Minimal Baseline PSA value] [Value: (ng/ml): 2] [Measurement: Minimal % increase in range of values]: [Value: 50%]